What is Heterochromia Iridis?

Heterochromia Iridis is a condition where the affected person has differences in the color of the iris.